Clinical trial inclusion criterion:
Patient who are fluid responsive. Fluid responsiveness is defined as increase of > 10% in mean arterial pressure (MAP) after passive leg raising (PLR)

Annotated entities:
- Condition: "fluid responsive"
- Measurement: "mean arterial pressure (MAP)"
- Qualifier: "after passive leg raising (PLR)"
- Value: "> 10%"